Azoles 抗真菌藥物，由構造上可分成 Imidazoles 及 Triazoles 兩大類。下列何者屬於 Imidazoles？
A. Fluconazole
B. Ketoconazole
C. Itraconazole
D. Voriconazole

正確答案：B. Ketoconazole